Clinical trial exclusion criterion:
High-grade block in the absence of a functioning pacemaker.

Annotated entities:
- Condition: "High-grade block"
- Negation: "in the absence of"
- Device: "pacemaker"
- Qualifier: "functioning"